Clinical trial exclusion criterion:
Systolic blood pressure outside the range of 100-160 mmHg or diastolic blood pressure above 95 mmHg at Screening

Annotated entities:
- Measurement: "Systolic blood pressure"
- Value: "outside the range of 100-160 mmHg"
- Measurement: "diastolic blood pressure"
- Value: "above 95 mmHg"
- Temporal: "at Screening"